Clinical trial inclusion criterion:
Women with one prior low transverse cesarean delivery

Entity relations:
- Has_multiplier("low transverse cesarean delivery", "one")